一位39歲的初產婦，目前妊娠39週，懷孕過程中的血壓都介於100～120/60～70 mmHg之間。今天產檢時發現血壓150/100 mmHg，但並無合併頭痛，視覺模糊，噁心，嘔吐或腹痛的情形。這位產婦來到產房之後血壓再測量為160/90 mmHg，血比容（hematocrit）為 0%，血小板數160,000/µL，肝功能指數GOT：22，GPT：15，尿液檢查並無蛋白尿情形，胎兒監視器並未發現胎兒窘迫的情況。這位產婦最可能符合下列那個診斷？
A. 子癎前症（preeclampsia）
B. 慢性高血壓（chronic hypertension）
C. 慢性高血壓合併子癎前症（chronic hypertension with superimposed）
D. 妊娠高血壓（gestational hypertension）

正確答案：D. 妊娠高血壓（gestational hypertension）